contraindication to regional anaesthesia (coagulopathies, concurrent anticoagulant therapy, allergy to local anaesthetics, infection at puncture site)

The above is a clinical trial exclusion criterion. Annotated with entity spans:
[Condition: contraindication] to [Procedure: regional anaesthesia (][Condition: coagulopathies], concurrent [Drug: anticoagulant therapy], [Condition: allergy] to [Procedure: local anaesthetics], [Condition: infection] at [Qualifier: puncture site])